What is caused by gain-of-function variants in SYK?

SYK gain-of-function variants cause immune dysregulation and systemic inflammation in humans and mice.